List the drug targets of Faricimab?

Faricimab, a bispecific antibody that inhibits VEGF-A and Ang-2.